Clinical trial exclusion criterion:
Unstable pulmonary embolism, deep vein thrombosis, or other significant arterial/venous thromboembolic event <=30 days before first dose of study treatment. If on anticoagulation, subject must be on stable therapeutic dose prior to first dose of study treatment.

Entity relations:
- Has_qualifier("pulmonary embolism", "Unstable")
- Has_index("<=30 days before first dose of study treatment", "first dose of study treatment")
- Has_qualifier("arterial thromboembolic event", "significant")
- Has_qualifier("arterial thromboembolic event", "other")
- Has_temporal("pulmonary embolism", "<=30 days before first dose of study treatment")
- Has_qualifier("therapeutic dose", "stable")
- Has_multiplier("anticoagulation", "therapeutic dose")
- Has_temporal("anticoagulation", "prior to first dose of study treatment")
- Has_index("prior to first dose of study treatment", "first dose of study treatment")
- OR("arterial thromboembolic event", "venous thromboembolic event")
- OR("pulmonary embolism", "deep vein thrombosis", "arterial thromboembolic event")
- OR("prior to first dose of study treatment", "first dose of study treatment")